Clinical trial inclusion criterion:
Ischemic symptoms or evidence of myocardial ischemia (inducible or spontaneous) in the presence of >50% de novo stenosis located in native coronary vessels

Entity relations:
- Has_qualifier("myocardial ischemia", "inducible")
- Has_mood("myocardial ischemia", "evidence")
- Has_value("stenosis", ">50%")
- Has_qualifier("stenosis", "de novo")
- AND("stenosis", "stenosis")
- multi("stenosis", "stenosis")
- Has_qualifier("stenosis", "native coronary vessels")
- AND("myocardial ischemia", "stenosis")
- OR("inducible", "spontaneous")
- OR("Ischemic symptoms", "myocardial ischemia")